Clinical trial inclusion criteria:
18 years of age or older
capable of providing informed consent

Annotated entities:
- Person: "age"
- Value: "18 years of or older"
- Informed_consent: "capable of providing informed consent"